smoked within the past year

The above is a clinical trial exclusion criterion. Annotated with entity spans:
[Observation: smoked] [Temporal: within the past year]